Clinical trial inclusion criteria:
hypoechoic uterine leiomyoma (echogenicity <3),
intramural leiomyomas with an ultrasonographic size <20 cm but >4cm,
indication to surgery (symptoms of menometrorrhagia,
menstrual disorder,
infertility,
pelvic pain or pelvic pressure

Annotated entities:
- Condition: "uterine leiomyoma"
- Qualifier: "hypoechoic"
- Measurement: "echogenicity"
- Value: "<3"
- Condition: "intramural leiomyomas"
- Measurement: "ultrasonographic size"
- Value: "<20 cm but >4cm"
- Mood: "indication to"
- Procedure: "surgery"
- Condition: "menometrorrhagia"
- Condition: "menstrual disorder"
- Condition: "infertility"
- Condition: "pelvic pain"
- Condition: "pelvic pressure"